Clinical trial exclusion criterion:
Acute disease at the time of enrolment

Entity relations:
- Has_temporal("Acute disease", "at the time of enrolment")
- Has_index("at the time of enrolment", "enrolment")